Clinical trial exclusion criterion:
Suspect or certainty of fetal malformation,

Entity relations:
- Has_mood("fetal malformation", "Suspect")
- OR("Suspect", "certainty")